Clinical trial inclusion criterion:
Prior hormonal therapy is allowed as:

Entity relations:
- Has_temporal("hormonal therapy", "Prior")
- Has_mood("hormonal therapy", "is allowed")